Current diagnosis of heart failure (New York Heart Association (NYHA) Class II-IV)

The above is a clinical trial exclusion criterion. Annotated with entity spans:
Current diagnosis of [Condition: heart failure] ([Measurement: New York Heart Association (NYHA) Class] [Value: II-IV])